下列何者是細菌和植物合成芳香族胺基酸（aromatic amino acids）過程中，重要的中間產物？
A. purine
B. chorismate
C. pyrimidine
D. p-aminobenzoic acid

正確答案：B. chorismate